愛滋病患者最常見的條件致病性真菌感染為：
A. 白色念珠菌（Candida albicans）引起的肺部感染
B. 新型隱球菌（Cryptococcus neoformans）引起的肺部感染
C. 卡氏肺囊蟲肺炎（Pneumocystis carinii pneumonia）
D. 毛癬菌（Trichophyton）引起的組織性壞死

正確答案：C. 卡氏肺囊蟲肺炎（Pneumocystis carinii pneumonia）